Clinical trial inclusion criterion:
Informed consent obtained

Annotated entities:
- Non-query-able: "Informed consent obtained"